Clinical trial inclusion criterion:
Ultrasound scanning at the first visit shows thickness of the achilles tendon above 7 mm or 20% thicker than the contralateral.

Annotated entities:
- Procedure: "Ultrasound scanning"
- Temporal: "at the first visit"
- Condition: "thickness of the achilles tendon"
- Qualifier: "above 7 mm"
- Qualifier: "20% thicker than the contralateral"